Clinical trial exclusion criterion:
Patient received acetaminophen within the past 4 hours

Entity relations:
- Has_temporal("acetaminophen", "within the past 4 hours")